下列何種藥物，於戰爭時被用於預防有機磷化學武器藥物不可逆結合至 cholinesterase？
A. atropine
B. pralidoxime
C. pyridostigmine
D. trospium

正確答案：C. pyridostigmine